Clinical trial exclusion criterion:
Patients who have received prior chemotherapy for unresectable disease

Annotated entities:
- Procedure: "chemotherapy"
- Condition: "unresectable disease"